Clinical trial exclusion criterion:
Poor compliance or refusal to participate.

Annotated entities:
- Observation: "Poor compliance"
- Observation: "refusal to participate"